有關無月經（amenorrhea）的敘述，下列何者錯誤？
A. 定義為2個月月經沒來
B. 須要先排除懷孕的可能性
C. 解剖結構上的異常造成無月經的比例相對較少
D. 高泌乳血症（hyperprolactinemia）有可能造成無月經

正確答案：A. 定義為2個月月經沒來